second trimester abortion

The above is a clinical trial inclusion criterion. Annotated with entity spans:
[Qualifier: second trimester] [Condition: abortion]